下列何種抗生素不是藉由抑制細菌之transpeptidase而干擾細胞壁之生成？
A. aztreonam
B. imipenem
C. nafcillin
D. bacitracin

正確答案：D. bacitracin